Clinical trial inclusion criteria:
Women (18-75 years) with suspected UTI
at least two symptoms of UTI (dysuria, urgency of micturition, frequency, lower abdominal pain)
Written informed consent

Annotated entities:
- Person: "Women"
- Person: "years"
- Value: "18-75"
- Condition: "UTI"
- Qualifier: "suspected"
- Condition: "symptoms of UTI"
- Multiplier: "at least two"
- Condition: "dysuria"
- Condition: "urgency of micturition"
- Condition: "frequency"
- Condition: "lower abdominal pain"
- Post-eligibility: "Written informed consent"